Clinical trial exclusion criterion:
History of allergy to any component of the IP

Annotated entities:
- Condition: "allergy"
- Drug: "any component of the IP"